一個安養院老人過去幾個月反覆性腹脹腹痛，常在排出大量氣體及水便而緩解，最近幾天又嚴重腹脹，已二天沒排氣、便而就醫，由 X 光可見 coffee bean sign，則下列何者正確？
A. 可能是癌症須立即安排手術
B. 若沒有急性腹症可先用鋇劑或大腸鏡檢查並緩解
C. 阻塞的位置最可能是升結腸（ascending colon）
D. 因長期反覆發作預後不佳

正確答案：B. 若沒有急性腹症可先用鋇劑或大腸鏡檢查並緩解